Clinical trial exclusion criterion:
Infiltration or previous surgery in the area

Entity relations:
- OR("Infiltration", "previous surgery")